Clinical trial exclusion criterion:
Poor venous access or inability to tolerate venipuncture.

Annotated entities:
- Condition: "Poor venous access"
- Procedure: "venipuncture"
- Condition: "inability to tolerate venipuncture"